adult female partner

The above is a clinical trial inclusion criterion. Annotated with entity spans:
[Person: adult] [Observation: female partner]